Es avascular el tejido:
1. Epitelial.
2. Conjuntivo.
3. Óseo.
4. Muscular.
5. Nervioso.

Respuesta correcta: 1. Epitelial.